Clinical trial exclusion criterion:
HOMA IR< 2.0

Entity relations:
- Has_value("HOMA IR", "< 2.0")